List peptide fragmentations methods in mass spectrometry

CID, HCD, ECD, ETD and PSD are different peptide fragmentation technologies used in mass spectrometry.